詳細的詢問病史及身體診查，是診斷傳染性疾病最重要的一環，下列何者不是常用口訣 TOCC 中的一項？
A. 治療用藥史
B. 職業史
C. 接觸史
D. 群聚現象

正確答案：A. 治療用藥史